Clinical trial inclusion criteria:
Patients scheduled for supine-positioned elective craniotomy for supratentorial malignant and non-malignant brain tumors 3 cm or larger (measured as the largest diameter in any plane on MR images)
ASA (American Society of Anesthesiologist) status 1-3 (27)
Written informed consent from participating patients

Annotated entities:
- Mood: "scheduled"
- Procedure: "supine-positioned elective craniotomy"
- Qualifier: "supratentorial"
- Qualifier: "malignant"
- Negation: "non"
- Qualifier: "malignant"
- Condition: "brain tumors"
- Qualifier: "3 cm or larger"
- Qualifier: "largest diameter in any plane"
- Procedure: "MR"
- Measurement: "ASA status"
- Measurement: "American Society of Anesthesiologist status"
- Value: "1-3"
- Value: "27"
- Informed_consent: "Written informed consent from participating patients"